¿Cuál de las siguientes funciones no es propia del estómago?
1. Almacenamiento de alimento.
2. Digestión de proteínas.
3. Secreción del factor intrínseco.
4. Secreción de hormonas.
5. Secreción de amilasa.

Respuesta correcta: 5. Secreción de amilasa.